Clinical trial exclusion criterion:
Use of concomitant antimicrobials in the first 4 days after enrolment with known activity against Gram-negative bacilli (except trimethoprim/sulphamethoxazole may be continued as Pneumocystis prophylaxis).

Annotated entities:
- Drug: "antimicrobials"
- Qualifier: "concomitant"
- Temporal: "first 4 days after enrolment"
- Reference_point: "enrolment"
- Observation: "Gram-negative bacilli"
- Negation: "except"
- Drug: "rimethoprim/sulphamethoxazole"